Clinical trial inclusion criterion:
Subjects undergoing treatment of statin for hypercholesterolemia

Annotated entities:
- Procedure: "treatment"
- Condition: "hypercholesterolemia"
- Drug: "statin"